Clinical trial exclusion criterion:
Prior treatment with cisplatin before randomization

Annotated entities:
- Drug: "cisplatin"
- Temporal: "before randomization"
- Reference_point: "randomization"